正常情形下，肌皮神經（musculocutaneous nerve）的末端會形成那一條皮神經？
A. 上臂內側皮神經（medial cutaneous nerve of arm）
B. 前臂內側皮神經（medial cutaneous nerve of forearm）
C. 前臂外側皮神經（lateral cutaneous nerve of forearm）
D. 前臂後側皮神經（posterior cutaneous nerve of forearm）

正確答案：C. 前臂外側皮神經（lateral cutaneous nerve of forearm）